Clinical trial inclusion criteria:
Patients provided written informed consent;
Patients aged between 18 and 75 years;
Knee symptomatic OA (Kellgren-Lawrence grade 1-4)
Failure of conservative treatment for at least 3 months;
Patients agreed to actively participate in the rehabilitation protocol and follow-up program;
Male or female patients;
Women of childbearing age had to use a proven method to prevent pregnancy, before the surgical treatment.

Annotated entities:
- Observation: "provided written informed consent"
- Person: "aged"
- Value: "between 18 and 75 years"
- Qualifier: "symptomatic"
- Condition: "OA Knee"
- Measurement: "Kellgren-Lawrence grade"
- Value: "1-4"
- Observation: "Failure"
- Procedure: "conservative treatment"
- Temporal: "for at least 3 months"
- Observation: "agreed to actively participate in the rehabilitation protocol"
- Observation: "agreed to actively participate in the follow-up program"
- Person: "Male"
- Person: "female"
- Observation: "childbearing age"
- Person: "Women"
- Observation: "method to prevent pregnancy"
- Temporal: "before the surgical treatment"
- Reference_point: "the surgical treatment"
- Procedure: "surgical treatment"